3 天大男嬰發現體重逐漸增加，尿量減少，四肢水腫，實驗室檢查發現 BUN/creatinine: 35/2.2 mg/dL，腎臟超音波發現兩側腎臟嚴重水腎，同時雙側之輸尿管擴大，膀胱內有大量尿液存積，產前檢查發現羊水少，下列那一選項較不恰當？
A. 要仔細觀察此病童之呼吸狀況，因此類病人可能合併肺部發育不全
B. 要安排 VCUG（voiding cystourethrography）檢查
C. 可能診斷為 UVJ 狹窄（ureterovesical junction stenosis）
D. 長大後有可能進展到腎衰竭

正確答案：C. 可能診斷為 UVJ 狹窄（ureterovesical junction stenosis）